What is the function of GvpA?

The gas vesicle wall is solely formed of proteins with the two major components, GvpA and GvpC,